Según la práctica totalidad de la literatura enfermera, cuál es considerada la primera escuela laica de formación enfermera reglada del mundo:
1. El Instituto Kaiserwerth de formación de enfermería.
2. La escuela de enfermeras del Hospital Saint Thomas de Londres.
3. La Fundación Catalina de Siena para la enseñanza de la enfermería.
4. Real Escuela de Enfermeras de Santa Isabel de Hungría.
5. Institución Civil de las Hermanas Enfermeras de la Merced.

Respuesta correcta: 2. La escuela de enfermeras del Hospital Saint Thomas de Londres.